Taking medicine within one month;

The above is a clinical trial exclusion criterion. Annotated with entity spans:
[Non-query-able: Taking medicine within one month];